Clinical trial inclusion criterion:
Serum albumin level = 3.5g/dl, ultrasound or CT scan confirmed ascites (=Grade 1)

Annotated entities:
- Measurement: "Serum albumin"
- Value: "= 3.5g/dl"
- Procedure: "ultrasound"
- Procedure: "CT scan"
- Condition: "ascites"
- Qualifier: "Grade 1"